Clinical trial exclusion criterion:
Complicated pharyngitis

Annotated entities:
- Condition: "pharyngitis"
- Qualifier: "Complicated"